Patients who are curable by conventional multidisciplinary management.

The above is a clinical trial exclusion criterion. Annotated with entity spans:
Patients who are [Qualifier: curable] by [Procedure: conventional multidisciplinary management].